有關調控人類月經週期之激素變化及其作用描述，下列何者錯誤？
A. 黃體促素（luteinizing hormone）在排卵前的大量分泌是造成排卵的主要原因
B. 血漿中助孕酮（progesterone）只有在排卵後才會明顯升高
C. 血漿中雌激素（estrogen）只會在排卵前有分泌增高的現象
D. 濾泡（follicle）顆粒細胞（granulosa cell）分泌之雌激素（estrogen）與卵的發育成熟有關

正確答案：C. 血漿中雌激素（estrogen）只會在排卵前有分泌增高的現象